Office or average home SBP > 180 mm Hg or DBP > 110 mm Hg (Average home BP in any seven day period during trial)

The above is a clinical trial exclusion criterion. Annotated with entity spans:
Office or average home [Measurement: SBP] [Value: > 180 mm Hg] or [Measurement: DBP] [Value: > 110 mm Hg] (Average home BP in any seven day period during trial)